Active clinically significant bleeding

The above is a clinical trial exclusion criterion. Annotated with entity spans:
[Qualifier: Active] clinically [Qualifier: significant] [Condition: bleeding]